Clinical trial inclusion criterion:
=1 doses of ticagrelor or prasugrel within 5 days before randomisation

Annotated entities:
- Multiplier: "=1 doses"
- Drug: "ticagrelor"
- Drug: "prasugrel"
- Temporal: "within 5 days before randomisation"
- Reference_point: "randomisation"